Clinical trial exclusion criterion:
Active infections

Entity relations:
- Has_temporal("infections", "Active")